下列何種疾病是因膽色素結合酵素（glucuronyl transferase）活性不良所引起新生兒間接型高膽色素血症  （indirect hyperbilirubinemia）之原因？
A. Gilbert disease
B. Hereditary spherocytosis
C. G6PD deficiency
D. ABO incompatibility

正確答案：A. Gilbert disease